Clinical trial inclusion criterion:
Patients with hepatocirrhosis: according to the standard of child- pugh, liver functions to achieve class A or B patients, Including C class patients but can achieve B class after treatment

Annotated entities:
- Condition: "hepatocirrhosis"